Use and unwillingness to stop use of other forms of nicotine such as cigars, pipes, or chewing tobacco

The above is a clinical trial exclusion criterion. Annotated with entity spans:
[Post-eligibility: Use and unwillingness to stop use of other forms of nicotine such as cigars, pipes, or chewing tobacco]